Clinical trial exclusion criterion:
Participant taking any glucose-containing medication concurrently

Annotated entities:
- Procedure: "glucose-containing medication"